Los fármacos bloqueantes de los receptores beta adrenérgicos:
1. Provocan hipotensión en individuos con presión arterial normal.
2. Aumentan la velocidad de conducción auriculo-ventricular.
3. Provocan inotropismo negativo.
4. Provocan un efecto cronotrópico positivo.
5. Aumentan la secreción de renina.

Respuesta correcta: 3. Provocan inotropismo negativo.